Approved clinical indication for pectoral pacemaker exchange (e.g. elective replacement indication (ERI), end of service (EOS))

The above is a clinical trial inclusion criterion. Annotated with entity spans:
Approved [Condition: clinical indication] for [Procedure: pectoral pacemaker exchange] (e.g. [Condition: elective replacement indication (ERI)], [Condition: end of service (EOS)])